Clinical trial exclusion criterion:
preoperative SpO2 less than 93%

Entity relations:
- Has_value("SpO2", "less than 93%")
- Has_temporal("SpO2", "preoperative")